Clinical trial exclusion criterion:
Pregnancy or nursing

Entity relations:
- OR("Pregnancy", "nursing")